下列何者屬於 anti-IgE 單株抗體（monoclonal antibody），可用於過敏性氣喘治療？
A. Basiliximab
B. Omalizumab
C. Abatacept
D. Efalizumab

正確答案：B. Omalizumab